La mayoría de las bacterias Gram positivas no crecen en el medio de MacConkey porque éste contiene:
1. Sales biliares y cristal violeta.
2. Lactosa e hidrolizado de caseína.
3. Rojo neutro.
4. Manitol.
5. Fucsina básica.

Respuesta correcta: 1. Sales biliares y cristal violeta.